一位 30 歲男性在員工體檢時被發現有輕微黃疸，他表示近 10 年來偶而會注意到自己眼白較黃，但無不適且無茶色尿及灰白便。偶而吃維他命及草藥。肝脾無腫大，且無慢性肝病特徵。實驗室檢查不正常者只有 total bilirubin 3 mg/dL（正常 0.3~1.0），其餘項目包括 direct bilirubin 0.2 mg/dL（正常 0.1~0.3）；AST、ALT、alkaline phosphatase、lactate dehydrogenase、hematocrit 等都正常，以下之診斷那一項最可能？
A. 藥物引起溶血
B. 膽道結石
C. Dubin-Johnson syndrome
D. Gilbert's syndrome

正確答案：D. Gilbert's syndrome